下列何者與水晶體異位（ectopia lentis）無關？
A. Marfan 症候群（Marfan syndrome）
B. Weill-Marchesani 症候群（Weill-Marchesani syndrome）
C. Homocysteine 代謝異常（homocystinuria）
D. 唐氏症候群（Down syndrome）

正確答案：D. 唐氏症候群（Down syndrome）